Una mutación que convierte el codón de un aminoácido en un codón de parada es:
1. Una mutación sin sentido.
2. Una transversión.
3. Una mutación silenciosa.
4. Una mutación de cambio del marco de lectura.

Respuesta correcta: 1. Una mutación sin sentido.